Immunosuppressive therapy before operation

The above is a clinical trial exclusion criterion. Annotated with entity spans:
[Procedure: Immunosuppressive therapy] [Temporal: before operation]